Clinical trial exclusion criterion:
(i.e. history of a severe allergic reaction to skin tests,,

Entity relations:
- AND("severe allergic reaction", "skin tests")
- Has_temporal("severe allergic reaction", "history")